Clinical trial exclusion criterion:
Affiliation of health care assurance

Annotated entities:
- Observation: "Affiliation of health care assurance"